What is the function of the SSX proteins?

The SYT protein appears to act as a transcriptional co-activator and the SSX proteins as co-repressors Taken together, these results led us to conclude that the SSX moiety, especially the most C-terminal 34 amino acids, of the SYT-SSX fusion proteins is crucial for aberrant spatial targeting and transcriptional control within the nucleus.